Clinical trial exclusion criterion:
Patients already taking warfarin, cilostazol or any other type of anti-platelet agents except aspirin and clopidogrel

Entity relations:
- Has_negation("aspirin", "except")
- AND("anti-platelet agents", "aspirin")
- OR("warfarin", "cilostazol", "anti-platelet agents")
- OR("aspirin", "clopidogrel")